Asplenia (absence of spleen or its removal);

The above is a clinical trial exclusion criterion. Annotated with entity spans:
[Condition: Asplenia] ([Negation: absence of] [Condition: spleen] or its removal);